Un fármaco con un modelo de distribución aparentemente monocompartimental se administra en forma de perfusión i.v. a una velocidad constante de 20 mg/h durante 48 h. Una vez finalizada la perfusión se extraen tres muestras de sangre que, al analizarlas, permiten calcular los parámetros primarios del modelo Kel = 0,0495 h-1, concentración al final de la perfusión (C48h) = 5,553 µg/mL, Vd = 66 L. ¿A qué tiempo se alcanzaría el estado estacionario?:
1. 14 h.
2. 28 h.
3. 42 h.
4. 56 h.
5. 70 h.

Respuesta correcta: 5. 70 h.